子宮頸的移行區（transformation zone），在陰道鏡檢查之下可以看到一些表徵，下列何者為該區之異常表徵？
A. Mature and immature metaplastic epithelium
B. Nabothian cysts
C. Opening of glands
D. Leukoplakia

正確答案：D. Leukoplakia